Chronic kidney disease stage 5 (GFR < 15 ml/min)

The above is a clinical trial exclusion criterion. Annotated with entity spans:
[Condition: Chronic kidney disease] [Qualifier: stage 5] ([Measurement: GFR] [Value: < 15 ml/min)]